¿Cuál es la última fase en el procedimiento básico del entrenamiento en autoinstrucciones de Meichenbaum?
1. Autoinstrucciones enmascaradas (en voz baja).
2. Modelado cognitivo.
3. Autoinstrucciones encubiertas.
4. Autoinstrucciones en voz alta.
5. Modelado cognitivo participante.

Respuesta correcta: 3. Autoinstrucciones encubiertas.